下列何者是描述 E. coli 的 Rho 因子？
A. 增加 RNA 合成速率
B. 去除 RNA Pol 結合在啟動子
C. 允許正常的轉錄作用
D. 參與 RNA 合成的終止反應

正確答案：D. 參與 RNA 合成的終止反應